Clinical trial exclusion criterion:
Preoperative use of an anticoagulant (Plavix, warfarin, lovenox, etc.)

Entity relations:
- Has_temporal("anticoagulant", "Preoperative")
- Subsumes("anticoagulant", "Plavix")
- OR("Plavix", "warfarin", "lovenox")